El Síndrome HELLP se define por un cuadro de:
1. Hipertensión arterial, proteinuria, edemas generalizados y aumento de peso por retención hídrica.
2. Anemia hemolítica microangiopática, disfunción hepática y trombocitopenia que puede progresar a coagulación intravascular diseminada, en gestantes con hipertensión arterial.
3. Anemia hemolítica, hipertensión arterial o elevación de la presión sistólica previa en 20 mm de Hg, proteinuria > 30 mg/dL en orina de 24 horas, elevación de transaminasas hepáticas y bajo nivel de conciencia.
4. Hipertensión arterial en gestantes de más de 20 semanas acompañada de anemia hemolítica, trombocitopenia, dolor epigástrico agudo y bajo nivel de conciencia.

Respuesta correcta: 2. Anemia hemolítica microangiopática, disfunción hepática y trombocitopenia que puede progresar a coagulación intravascular diseminada, en gestantes con hipertensión arterial.